下列那一種治療帕金森氏症的藥物，容易發生攝護腺腫大及胃腸道閉塞等副作用？
A. deprenyl
B. levodopa
C. bromocriptine
D. benztropine

正確答案：D. benztropine